Pregnant women or likely to be in the absence of effective contraception,

The above is a clinical trial exclusion criterion. Annotated with entity spans:
[Observation: Pregnant] [Person: women] or [Mood: likely to be] [Qualifier: in the absence of effective contraception],